下列有關胰島素的描述，何者錯誤？
A. 腦神經細胞對葡萄糖的吸收需要依賴胰島素
B. 胰島素敏感性細胞多含有第四型葡萄糖轉運蛋白（GLUT4）
C. 胰島素可以增加脂肪細胞對葡萄糖的吸收作用
D. 胰島素可以增加骨骼肌之肝醣合成作用

正確答案：A. 腦神經細胞對葡萄糖的吸收需要依賴胰島素